Clinical trial inclusion criterion:
3. Be able and willing to follow instructions, including participation in all study assessments and visits.

Annotated entities:
- Parsing_Error: "3."
- Post-eligibility: "Be able and willing to follow instructions, including participation in all study assessments and visits."
- Non-query-able: "Be able and willing to follow instructions, including participation in all study assessments and visits."